有關蠅蛆症（myiasis）之敘述，下列何者錯誤？
A. 人膚蠅（Dermatobia hominis）產卵於吸血性蚊/蠅之腹部而致孵化之幼蟲鑽入宿主皮膚傷口
B. 院內蠅蛆症（nosocomial myiasis）常發生於⻑期臥床且有開放性傷口病患
C. 耳部蠅蛆症（aural myiasis）病患常有蟲體爬動感、雜音及惡臭分泌物
D. 人膚蠅（Dermatobia hominis）傳播之蠅蛆症經常發生於亞洲地區

正確答案：D. 人膚蠅（Dermatobia hominis）傳播之蠅蛆症經常發生於亞洲地區